Clinical trial inclusion criterion:
Patients who are 19 years or older on screening

Annotated entities:
- Person: "years"
- Value: "19 or older"
- Temporal: "on screening"
- Reference_point: "screening"